Clinical trial exclusion criterion:
currently pregnant (positive pregnancy test), planning pregnancy, or lactating (women)

Annotated entities:
- Temporal: "currently"
- Condition: "pregnant"
- Measurement: "pregnancy test"
- Value: "positive"
- Mood: "planning"
- Condition: "pregnancy"
- Condition: "lactating"